Must have pathologically confirmed invasive adenocarcinoma or ductal carcinoma in situ of the breast.

The above is a clinical trial inclusion criterion. Annotated with entity spans:
Must have [Procedure: pathologically] [Value: confirmed] [Condition: invasive adenocarcinoma] or [Condition: ductal carcinoma in situ] [Qualifier: of the breast].